El flujo electrónico cíclico de la fotosíntesis:
1. Utiliza los componentes del fotosistema II junto con la plastocianina y el citocromo b6f.
2. Genera ATP y NADPH.
3. Se produce en situaciones en las que el NADPH escasea.
4. Genera ATP sin que se reduzca NADP+.
5. Libera O2.

Respuesta correcta: 4. Genera ATP sin que se reduzca NADP+.